Not pregnant for female subjects.

The above is a clinical trial inclusion criterion. Annotated with entity spans:
[Negation: Not] [Condition: pregnant] for [Person: female] subjects.